Clinical trial exclusion criterion:
HIV or other chronic disease

Entity relations:
- Has_qualifier("chronic disease", "other")
- OR("HIV", "chronic disease")